Clinical trial exclusion criterion:
Allergy to narcotic medications

Annotated entities:
- Condition: "Allergy"
- Drug: "narcotic medications"